Estimated Glomerular Filtration Rate (eGFR) < 30 ml/min

The above is a clinical trial exclusion criterion. Annotated with entity spans:
[Measurement: Estimated Glomerular Filtration Rate (eGFR)] [Value: < 30 ml/min]